Clinical trial exclusion criterion:
Patient has participated in a combination trial where ruxolitinib was dispensed in combination with another study medication and the patient is still receiving combination therapy.

Annotated entities:
- Competing_trial: "Patient has participated in a combination trial where ruxolitinib was dispensed in combination with another study medication and the patient is still receiving combination therapy"